有關於 Panner disease 之敘述，下列何者錯誤？
A. 是發生於肱骨小頭（capitellum）的骨軟骨病變（osteochondrosis）
B. 發生於右側肘關節的機率高於左側肘關節
C. 好發於 5 至 11 歲兒童
D. 最常見的症狀是痠痛及肘關節彎曲的侷限

正確答案：D. 最常見的症狀是痠痛及肘關節彎曲的侷限